Clinical trial exclusion criterion:
Complications to RYGB. Documented reactive hypoglycaemia, severe dumping (vomiting, diarrhea, severe abdominal pain after food intake).

Annotated entities:
- Condition: "Complications"
- Procedure: "RYGB"
- Condition: "reactive hypoglycaemia"
- Qualifier: "severe"
- Condition: "dumping"
- Condition: "vomiting"
- Condition: "diarrhea"
- Qualifier: "severe"
- Condition: "abdominal pain"
- Temporal: "after food intake"
- Reference_point: "food intake"